>= 18 years

The above is a clinical trial inclusion criterion. Annotated with entity spans:
[Value: >= 18] [Person: years]